Las intervenciones que contribuyen al éxito tras una parada cardiaca ocurrida en la calle se denominan "cadena de supervivencia". ¿Cuál de las siguentes opciones conforman el orden adecuado de sus eslabones?
1. Desfibrilación inmediata. Pedir ayuda. Maniobras de soporte vital. Cuidados postresucitación.
2. Abrir la vía aérea. Pedir ayuda. Desfibrilación. Cuidados post-resucitación.
3. Compresiones         torácicas     inmediatas. Desfibrilación y solicitud de ayuda. Cuidados post-resucitación.
4. Ventilación boca a boca. Compresiones torácicas     intermitentes.    Desfibrilación. Solicitar ayuda. Cuidados post-resucitación.
5. Reconocimiento precoz y pedir ayuda. Resucitación       cardiopulmonar      precoz. Desfibrilación precoz. Cuidados postresucitación.

Respuesta correcta: 5. Reconocimiento precoz y pedir ayuda. Resucitación       cardiopulmonar      precoz. Desfibrilación precoz. Cuidados postresucitación.